Clinical trial exclusion criterion:
The existence of RPE tear

Annotated entities:
- Condition: "RPE tear"